Which class of genes are mutated in Diamond Blackfan Anemia patients?

Currently nine genes, all encoding ribosomal proteins (RP), have been found mutated in approximately 50% of patients.